Clinical trial inclusion criteria:
Age >/=18 years at screening
Patients with relapsing forms of multiple sclerosis (RMS) with active disease defined by clinical or imaging features: (i) at least one clinical relapse over a 6-month period prior to screening; (ii) AND/OR at least one T1 gadolinium-enhancing lesion or new and/or enlarging T2 lesion as detected by brain Magnetic Resonance Imaging (MRI) performed over a 3 months period prior to screening with no change of Disease-Modifying Treatment(s) (DMT) compared to a previous MRI performed within 24 months before screening
For women of childbearing potential: agreement to use an acceptable birth control method during the treatment period and for at least 12 months after the last dose of ocrelizumab
Participants should be beneficiary of healthcare coverage under the social security system

Annotated entities:
- Person: "Age"
- Value: ">/=18 years"
- Temporal: "at screening"
- Qualifier: "relapsing forms"
- Condition: "multiple sclerosis (RMS)"
- Qualifier: "active disease"
- Observation: "imaging features"
- Observation: "clinical features"
- Multiplier: "at least one over a 6-month period"
- Condition: "clinical relapse"
- Temporal: "prior to screening"
- Multiplier: "at least one over a 3 months period"
- Temporal: "prior to screening"
- Condition: "T1 gadolinium-enhancing lesion"
- Condition: "T2 lesion"
- Procedure: "brain Magnetic Resonance Imaging (MRI)"
- Qualifier: "enlarging"
- Temporal: "new"
- Negation: "no"
- Multiplier: "change of"
- Procedure: "Disease-Modifying Treatment(s) (DMT)"
- Non-representable: "compared to a previous MRI performed within 24 months before screening"
- Pregnancy_considerations: "For women of childbearing potential: agreement to use an acceptable birth control method during the treatment period and for at least 12 months after the last dose of ocrelizumab"
- Observation: "beneficiary of healthcare coverage"